Clinical trial inclusion criterion:
one licensed NNRTI or boosted protease inhibitor

Entity relations:
- Has_qualifier("NNRTI", "licensed")
- Has_multiplier("NNRTI", "one")
- OR("NNRTI", "boosted protease inhibitor")